Clinical trial exclusion criterion:
Subjects receiving chronic or prophylactic antibiotic therapy.

Entity relations:
- OR("chronic antibiotic therapy", "prophylactic antibiotic therapy")